Female subjects, who are of childbearing age (i.e. adolescent), who are pregnant or nursing;

The above is a clinical trial exclusion criterion. Annotated with entity spans:
[Pregnancy_considerations: Female subjects, who are of childbearing age (i.e. adolescent), who are pregnant or nursing];